Clinical trial inclusion criterion:
Kyrgyz ethnicity

Annotated entities:
- Non-query-able: "Kyrgyz ethnicity"